Which class of genes are mutated in Diamond Blackfan Anemia patients?

In 25% of patients with Diamond-Blackfan anaemia 19q13 gene mutation was detected, and recent findings suggest another gene located on 8p23.3-p22 chromosome. Diamond Blackfan anemia (DBA) is an inherited erythroblastopenia associated with mutations in at least 8 different ribosomal protein genes. Currently nine genes, all encoding ribosomal proteins (RP), have been found mutated in approximately 50% of patients. We also report the prevalence of RPS 19 mutations in the Italian DBA population, as shown by an analysis of 56 patients. Experimental evidence supports the hypothesis that DBA is primarily the result of defective ribosome synthesis.